Clinical trial exclusion criterion:
Patients with epilepsy requiring medications (such as steroids or antiepileptic drugs)

Entity relations:
- AND("epilepsy", "medications")
- Subsumes("medications", "steroids")
- OR("steroids", "antiepileptic drugs")